Clinical trial exclusion criterion:
history of pyelonephritis

Annotated entities:
- Condition: "pyelonephritis"